Radial arterial pulse may be present or absent by palpation.

The above is a clinical trial inclusion criterion. Annotated with entity spans:
[Qualifier: Radial arterial] [Condition: pulse] may be [Value: present] or [Value: absent] by [Measurement: palpation].